All women of childbearing potential (WOCBP) must be practicing a medically acceptable method of birth control

The above is a clinical trial inclusion criterion. Annotated with entity spans:
All [Person: women] of [Condition: childbearing potential] ([Condition: WOCBP]) must be practicing a [Qualifier: medically acceptable] method of [Procedure: birth control]